Clinical trial exclusion criteria:
Patients unable to understand the objectives of the dietary intervention
Patients in paliative care
Patients receiving supplement diets

Annotated entities:
- Non-query-able: "Patients unable to understand the objectives of the dietary intervention"
- Context_Error: "Patients in paliative care"
- Undefined_semantics: "Patients receiving supplement diets"